Clinical trial exclusion criterion:
High suicide risk, i.e. intent or plan to attempt suicide in near future;

Annotated entities:
- Observation: "suicide risk"
- Qualifier: "High"
- Mood: "intent"
- Mood: "plan to"
- Observation: "attempt suicide"
- Temporal: "in near future"